Clinical trial inclusion criterion:
Patient with record of congenital AAT deficiency of phenotype PiZZ (homozygote) or other rare phenotypes related to AAT deficiency and with AAT serum level ≤ 11 micromole. For patients receiving IV AAT augmentation therapy the serum AAT level threshold does not apply.

Entity relations:
- Has_value("AAT serum level", "≤ 11 micromole")
- OR("congenital AAT deficiency of phenotype PiZZ (homozygote)", "rare phenotypes related to AAT deficiency")